Clinical trial inclusion criterion:
Normal motor and cognitive development up to time of injury

Entity relations:
- multi("up to time of injury", "time of injury")
- Has_value("cognitive development", "Normal")
- Has_temporal("cognitive development", "up to time of injury")
- Has_value("motor development", "Normal")
- Has_temporal("motor development", "up to time of injury")